Clinical trial inclusion criterion:
Males or females aged >/= 50 years

Annotated entities:
- Person: "Males"
- Person: "females"
- Person: "aged"
- Value: ">/= 50 years"